Tras un accidente de tráfico un paciente de 38 años ingresa en UCI en coma. Tras varios días el paciente no mejora neurológicamente y en la TAC se visualizan lesiones puntiformes hemorrágicas en cuerpo calloso y en unión cortico-subcortical. ¿Cuál es su diagnóstico?
1. Hematoma subdural agudo.
2. Púrpura trombocitopénica.
3. Contusión hemorrágica cerebral.
4. Lesión axonal difusa grave.
5. Encefalopatía hipóxico-isquémica.

Respuesta correcta: 4. Lesión axonal difusa grave.